患者做腦部切片檢查，鏡下觀察發現噬神經元的現象（neuronophagia），該變化最常出現於下列何病況？
A. 缺血性液化壞死
B. 病毒性腦炎
C. 神經退化疾病
D. 高度惡性腦瘤

正確答案：B. 病毒性腦炎